Clinical trial inclusion criterion:
Current DSM-IV diagnosis of cannabis dependence, >1 week detoxified and abstinent;

Entity relations:
- Has_multiplier("detoxified", ">1 week")
- Has_qualifier("cannabis dependence", "DSM-IV")
- Has_multiplier("abstinent", ">1 week")